Clinical trial exclusion criterion:
previous esophageal treatment by another method ablation: photodynamic therapy, argon plasma coagulation, laser, ....

Entity relations:
- Has_qualifier("ablation", "another method")
- Has_temporal("esophageal treatment", "previous")
- Subsumes("ablation", "photodynamic therapy")
- AND("esophageal treatment", "ablation")
- OR("photodynamic therapy", "argon plasma coagulation", "laser")